Clinical trial exclusion criterion:
Concomitant use with oral anticoagulant drugs

Entity relations:
- Has_temporal("oral anticoagulant drugs", "Concomitant")